El bevacizumab es un anticuerpo monoclonal:
1. Que actúa inhibiendo el factor de crecimiento endotelial vascular (VEGF) antes de su incorporación al receptor.
2. Contra el antígeno CD-20.
3. Quimérico cuya diana es el receptor tipo 1del factor de crecimiento epidérmico (EGF).
4. Humano IgG1 específico para el antígeno CD-52.

Respuesta correcta: 1. Que actúa inhibiendo el factor de crecimiento endotelial vascular (VEGF) antes de su incorporación al receptor.